下列職業性癌症之配對，何者錯誤？
A. 掃煙囪-陰囊癌
B. 砷-皮膚癌
C. 苯-白血病
D. 染料工廠-甲狀腺癌

正確答案：D. 染料工廠-甲狀腺癌